Patients with de novo stenotic lesions who are suitable for coronary stenting with drug-eluting stent

The above is a clinical trial inclusion criterion. Annotated with entity spans:
Patients with [Qualifier: de novo] [Condition: stenotic lesions] who are [Mood: suitable] for [Procedure: coronary stenting] with [Device: drug-eluting stent]